Clinical trial exclusion criterion:
Women who are breastfeeding, pregnant, or desiring pregnancy

Annotated entities:
- Pregnancy_considerations: "Women who are breastfeeding, pregnant, or desiring pregnancy"